Clinical trial inclusion criterion:
Between the age of 25 to 65 at baseline

Annotated entities:
- Value: "Between 25 to 65"
- Person: "age"
- Temporal: "at baseline"